Clinical trial exclusion criterion:
History or known presence of systemic autoimmune disorders potentially causing progressive neurologic disease (e.g., lupus, anti-phospholipid antibody syndrome, Sjogren's syndrome, Behçet's disease, sarcoidosis)

Annotated entities:
- Temporal: "History"
- Condition: "systemic autoimmune disorders"
- Condition: "progressive neurologic disease"
- Mood: "potentially causing"
- Condition: "lupus"
- Condition: "anti-phospholipid antibody syndrome"
- Condition: "Sjogren's syndrome"
- Condition: "Behçet's disease"
- Condition: "sarcoidosis"